Clinical trial exclusion criterion:
previous unusual response to esmolol

Entity relations:
- AND("unusual response", "esmolol")